Es un parásito intracelular obligado:
1. Helicobacter pylori.
2. Yersinia enterocolitica.
3. Rickettsia prowazekii.
4. Staphylococcus aureus.

Respuesta correcta: 3. Rickettsia prowazekii.